En la cromatografía iónica de supresión:
1. Se emplea una única columna y se mantiene la conductividad de la fase móvil muy baja.
2. El eluyente debe poder ser eliminado de modo selectivo tras la separación y de forma previa a la medida conductimétrica.
3. El eluyente incorpora una disolución regenerante de ácido fuerte que fluye en el mismo sentido de la fase móvil.
4. Se utilizan intercambiadores débiles a partir de polímeros de poliestireno.
5. Se emplea una fase móvil con gradiente iónico de conductividades.

Respuesta correcta: 2. El eluyente debe poder ser eliminado de modo selectivo tras la separación y de forma previa a la medida conductimétrica.